Clinical trial exclusion criterion:
Contraindication to Filgrastim

Entity relations:
- AND("Contraindication", "Filgrastim")